Tuberous sclerosis 的臨床表徵不包含：
A. 視神經的 glioma
B. 心臟的 rhabdomyoma
C. 視網膜的 hamartoma
D. 腦部的 cortical tuber

正確答案：A. 視神經的 glioma